對於 B 型、T 型細胞的抗原受體（antigen receptor），下列那一種描述錯誤？
A. 抗原受體的基因必須經重組後，蛋白質才能被表現
B. 抗原受體呈現於細胞膜上
C. 抗原受體依靠其他蛋白質複合體傳遞訊息
D. 細胞活化後，其抗原受體都會被分泌到細胞外

正確答案：D. 細胞活化後，其抗原受體都會被分泌到細胞外